Clinical trial inclusion criterion:
Willing to receive the unlicensed vaccine given as an IM injection

Annotated entities:
- Non-query-able: "Willing to receive the unlicensed vaccine given as an IM injection"
- Drug: "vaccine"
- Procedure: "IM injection"